Clinical trial exclusion criterion:
use of any other investigational or non-registered drug or vaccine during the study period or within 30 days preceding the study vaccine

Annotated entities:
- Procedure: "vaccine"
- Procedure: "drug"
- Qualifier: "investigational"
- Qualifier: "non-registered"
- Temporal: "during the study period"
- Temporal: "within 30 days preceding the study vaccine"
- Reference_point: "study period"
- Reference_point: "study vaccine"